35歲王小姐，餐廳服務員，主訴雙膝痠痛已三個月。她的身體質量指數（BMI）為32 Kg/m2，最近她了解膝痛與體重有關，覺得現在是該減重的時候了，準備在一個月內採取行動。根據跨越理論模式 （transtheoretical model），王小姐是處於行為改變的那一階段？
A. 未考慮階段（precontemplation）
B. 考慮階段（contemplation）
C. 準備階段（preparation）
D. 行動階段（action）

正確答案：C. 準備階段（preparation）